Clinical trial exclusion criterion:
Pregnant and/or nursing mothers.

Annotated entities:
- Condition: "Pregnant"
- Condition: "nursing"